一位 10 歲男童，因昏迷而被學校保健護士送至醫院急診室。到院時有自發性呼吸，醫師叫他沒反應，身體診察四肢鬆軟無力，痛刺激手部時眼睛會張開、手會縮回，此時之葛氏昏迷指數（Glasgow coma scale）為多少分？
A. 6
B. 7
C. 8
D. 9

正確答案：B. 7